¿Qué característica es cierta con respecto a los test referidos al criterio?
1. La finalidad es describir al sujeto en el continuo de algún rasgo.
2. El objetivo es maximizar las diferencias individuales.
3. Las puntuaciones obtenidas sólo tienen significado en relación a los resultados del grupo normativo.
4. Permiten interpretar las puntuaciones en sentido absoluto, sin referencia a ningún grupo.
5. Los ítems suelen derivarse de alguna teoría de rasgos.

Respuesta correcta: 4. Permiten interpretar las puntuaciones en sentido absoluto, sin referencia a ningún grupo.